29歲孕婦，妊娠11週，B型肝炎帶原者篩檢結果為HBsAg（+），HBeAg（+）；妊娠24週B型肝炎病毒 （HBV）DNA檢驗結果為108 copies/mL。孕婦於妊娠28週開始口服抗HBV藥物Tenofovir治療至妊娠38週，經陰道自然分娩出3,480公克女嬰。為預防嬰兒感染B型肝炎的最適當處置為：
A. 新生兒出生後立即給與B型肝炎免疫球蛋白治療，同時安排B型肝炎疫苗預防接種
B. 新生兒出生後立即給與B型肝炎免疫球蛋白治療，不必安排B型肝炎疫苗預防接種
C. 新生兒出生後不必給與B型肝炎免疫球蛋白治療，只需安排B型肝炎疫苗預防接種
D. 新生兒出生後不必給與B型肝炎免疫球蛋白治療，也不必安排B型肝炎疫苗預防接種

正確答案：A. 新生兒出生後立即給與B型肝炎免疫球蛋白治療，同時安排B型肝炎疫苗預防接種